Patients with dexamethasone intolerance.

The above is a clinical trial exclusion criterion. Annotated with entity spans:
Patients with [Drug: dexamethasone] [Condition: intolerance].